Expected survival period= 6 months

The above is a clinical trial inclusion criterion. Annotated with entity spans:
[Observation: Expected survival period][Value: = 6 month]s